6. Newly diagnosed with PAH and not on PAH-specific therapy.

The above is a clinical trial exclusion criterion. Annotated with entity spans:
[Parsing_Error: 6.] [Temporal: Newly diagnosed] with [Condition: PAH] and [Negation: not] on [Procedure: PAH-specific therapy].